Clinical trial inclusion criterion:
No gingivitis (Community Periodontal Index score = 0).

Entity relations:
- Has_value("Community Periodontal Index score", "= 0")
- Has_negation("gingivitis", "No")
- Subsumes("gingivitis", "Community Periodontal Index score")